Clinical trial inclusion criterion:
Patients aged between 18 and 75 years;

Annotated entities:
- Person: "aged"
- Value: "between 18 and 75 years"